Cuando usted valora al paciente oncológico ¿en qué Patrón Funcional de M. Gordon se incluye el Índice de Barthel?:
1. Cognitivo-Perceptual.
2. Actividad-Ejercicio.
3. Percepción-Manejo de la Salud.
4. Nutricional-Metabólico.
5. Autopercepción-Autoconcepto.

Respuesta correcta: 2. Actividad-Ejercicio.